下列何者作為前腭唇裂（cleft lip and palate）和後腭唇裂分界的指標？
A. 盲孔（foramen cecum）
B. 門齒窩（incisive fossa）
C. 大腭管（greater palatine canal）
D. 卵圓孔（foramen ovale）

正確答案：B. 門齒窩（incisive fossa）